Mujer de 25 años, sin antecedentes de interés ni hábitos tóxicos que acude a urgencias por dolor intenso en el oído derecho, imposibilidad total para abrir la boca, de instauración súbita y sin antecedente traumático previo. Refiere usar placa de descarga por hábito de apretamiento dental nocturno. ¿Cuál es su diagnóstico?
1. Luxación del cóndilo mandibular por delante de la eminencia articular.
2. Bloqueo articular agudo (luxación anterior del menisco articular).
3. Fractura cóndilo mandibular.
4. Anquilosis fibrosa de la articulación temporomandibular.
5. Anquilosis ósea de la articulación temporomandibular.

Respuesta correcta: 2. Bloqueo articular agudo (luxación anterior del menisco articular).